Clinical trial inclusion criterion:
currently on buprenorphine maintenance therapy

Annotated entities:
- Drug: "buprenorphine"
- Procedure: "buprenorphine maintenance therapy"
- Temporal: "currently"